Clinical trial exclusion criterion:
Patients have a history of allergy to one component of triple therapy regimen (proton pump inhibitor, penicillin, and / or macrolide) before.

Entity relations:
- AND("allergy", "component of triple therapy regimen")
- Has_temporal("allergy", "history")
- Subsumes("component of triple therapy regimen", "proton pump inhibitor")
- OR("proton pump inhibitor", "penicillin", "macrolide")